What genes are drug targets for Fibrodysplasia Ossificans Progressiva (FOP)?

Recently, FOP has been associated with a specific mutation of ACVR1, the gene coding for a bone morphogenetic protein type I receptor.